Cuando usted valora el estado nutricional del paciente en el período preoperatorio, ha de saber que si éste sufre un déficit de Vitamina C, puede presentar en el postoperatorio:
1. Problemas en la síntesis de protombina.
2. Taquicardia.
3. Leucopenia.
4. Problemas de cicatrización en la herida.
5. Alteración en el metabolismo de los hidratos de carbono.

Respuesta correcta: 4. Problemas de cicatrización en la herida.